Clinical trial exclusion criterion:
Patients with active autoimmune disease or a documented history of autoimmune disease or syndrome that requires systemic steroids or immunosuppressive agents. Patients with vitiligo or resolved childhood asthma/atopy would be exception to this rule. Patients that require inhaled steroids or local steroid injections would not be excluded from the study. Patients with hypothyroidism not from autoimmune disease that is stable on hormone replacement will not be excluded from the study.

Annotated entities:
- Condition: "autoimmune disease"
- Temporal: "active"
- Condition: "autoimmune disease"
- Temporal: "history"
- Condition: "syndrome that requires systemic steroids"
- Drug: "systemic steroids"
- Undefined_semantics: "syndrome that requires systemic steroids"
- Drug: "immunosuppressive agents"
- Condition: "syndrome that requires immunosuppressive agents"
- Condition: "childhood asthma"
- Qualifier: "resolved"
- Condition: "vitiligo"
- Condition: "atopy"
- Not_a_criteria: "Patients with vitiligo or resolved childhood asthma/atopy would be exception to this rule."
- Not_a_criteria: "Patients that require inhaled steroids or local steroid injections would not be excluded from the study."
- Condition: "hypothyroidism"
- Condition: "autoimmune disease"
- Negation: "not"
- Qualifier: "stable on hormone replacement"
- Procedure: "hormone replacement"
- Grammar_Error: "will not be excluded from the study"
- Not_a_criteria: "Patients with hypothyroidism not from autoimmune disease that is stable on hormone replacement will not be excluded from the study."